¿Qué secuencia de bases del ARN se producirá al transcribirse el fragmento de ADN AGGCCTTTACGC?:
1. TCCGGAAATGCG.
2. AGGCCUUUACGC.
3. UGGCCUUUUGCG.
4. UGGCCUUUUCGC.
5. UCCGGAAAUGCG.

Respuesta correcta: 5. UCCGGAAAUGCG.